Clinical trial exclusion criterion:
2-hour C-peptide level < 1.8 ng/mL.

Annotated entities:
- Measurement: "2-hour C-peptide level"
- Value: "< 1.8 ng/mL"